在細胞中，管家基因 （housekeeping genes）的種類繁多，但個別基因的表現量不同。下列何者是調控管家基因表現的最主要機制？
A. 各基因產物合成率一致，但其降解速率各異
B. 各基因所轉錄的mRNA量一致，但其轉譯的速率各異
C. 各基因的啟動子對RNA聚合酶的親和力各異
D. 各基因表現的程度受到不同的誘導或抑止因子所調節

正確答案：C. 各基因的啟動子對RNA聚合酶的親和力各異